一名 58 歲女性，頸部右側摸到一個慢慢變大的腫塊而就診。大小 3 公分，電腦斷層檢查發現頸動脈分枝處有一個界限清楚的實體腫瘤。光學顯微鏡下可見腫瘤細胞有粉紅色顆粒樣的細胞質，呈團塊狀排列。電子顯微鏡發現腫瘤細胞的細胞質中有神經分泌顆粒（neurosecretory granules）存在。下列何者是可能的診斷？
A. 轉移性鱗狀細胞癌（metastatic squamous cell carcinoma）
B. 轉移性甲狀腺濾泡癌（metastatic thyroid follicular carcinoma）
C. 副神經節瘤（paraganglioma）
D. Warthin tumor

正確答案：C. 副神經節瘤（paraganglioma）